下列何者不屬於椎間盤（intervertebral disc）的組成物？
A. 軟骨終板（cartilaginous endplate）
B. 後縱韌帶（posterior longitudinal ligament）
C. 髓核（nucleus pulposus）
D. 環狀的纖維（annulus fibrosus）

正確答案：B. 後縱韌帶（posterior longitudinal ligament）